Raile y Marriner en sus estudios sobre los trabajos teóricos en enfermería, revisan diferentes aspectos entre los que están los referidos a la semántica y estructura. Este análisis del marco teórico concreto hace referencia a:
1. La simplicidad.
2. La generalidad.
3. La precisión empírica.
4. Las consecuencias deducibles.
5. La claridad.

Respuesta correcta: 5. La claridad.